關於各種器官移植手術的麻醉敘述，下列何者正確？
A. 末期腎病常併有嚴重動脈硬化，術前須詳細評估心血管狀況
B. 肝臟移植患者須注意凝血異常、腦功能異常及腎功能異常，不可在手術房中拔除氣管內管，也不宜使用 narcotics 作術後止痛
C. 胰臟移植患者常合併肝臟移植，不應減少藥物使用量並嚴格監測血糖
D. 腦幹死的器官捐贈者於器官捐贈手術中如發生心跳過慢，atropine 是首選藥物

正確答案：A. 末期腎病常併有嚴重動脈硬化，術前須詳細評估心血管狀況